Minors

The above is a clinical trial exclusion criterion. Annotated with entity spans:
[Person: Minors]